Clinical trial inclusion criterion:
18 years or older

Entity relations:
- Has_value("older", "18 years or older")